Current triglyceride level > 400 mg/dl

The above is a clinical trial exclusion criterion. Annotated with entity spans:
Current [Measurement: triglyceride level] [Value: > 400 mg/dl]